一位腹水病人之血中白蛋白（albumin）是3.0 g/dL，腹水中的白蛋白是1.2 g/dL，下列何項診斷較不可能？
A. 肝硬化（liver cirrhosis）
B. 鬱血性心衰竭（congestive heart failure）
C. 腎病症候群（nephrotic syndrome）
D. Budd-Chiari症候群（Budd-Chiari syndrome）

正確答案：C. 腎病症候群（nephrotic syndrome）